一位55歲男性，妻子抱怨經常被他半夜睡覺時每隔20到90秒不等的一陣陣腿抖動吵醒，這種腿抖動以腳掌及大拇趾dorsiflexion為主，每次抖動約0.5 到5秒，他辯稱自己完全不知道，但自覺睡眠品質差，白天工作時常打瞌睡。關於此一病人之病症，下列敘述何者錯誤？
A. 最可能診斷為睡眠陣發性肢體動作症（periodic limb movements in sleep）
B. 腦電圖（EEG）上可發現在腿抖動的對側大腦額葉運動區，伴隨有20到90秒一次之癲癇放電（epileptic
C. 常伴隨有不寧腿症候群（restless legs syndrome）
D. dopamine agonist 或 anticonvulsants對部分病人有效

正確答案：B. 腦電圖（EEG）上可發現在腿抖動的對側大腦額葉運動區，伴隨有20到90秒一次之癲癇放電（epileptic